Clinical trial exclusion criterion:
Patients weighing <55kgs.

Entity relations:
- Has_value("weighing", "<55kgs")